Clinical trial inclusion criterion:
Can achieve a distance visual acuity of 20/30 (0.18 logMAR) or better in each eye with the study contact lenses.

Entity relations:
- Has_value("distance visual acuity", "20/30 or better")
- AND("distance visual acuity", "study contact lenses")
- Has_value("distance visual acuity", "0.18 logMAR or better")